Clinical trial exclusion criterion:
chromosome aberrations in anyone of the couple.

Entity relations:
- Has_context("chromosome aberrations", "anyone of the couple")
- multi("anyone of the couple", "anyone of the couple")